En un paciente con Insuficiencia Renal, los fármacos por vía oral se deben administrar:
1. Con zumos naturales de frutas.
2. Con el menor volumen de líquido posible.
3. Con el mismo volumen que a cualquier otro paciente.
4. Con el mayor volumen de líquido posible.
5. Siempre durante la hemodiálisis.

Respuesta correcta: 2. Con el menor volumen de líquido posible.